¿Cuál de las siguientes especies bacterianas no es una enterobacteria?
1. Escherichia coli.
2. Proteus vulgaris.
3. Klebsiella pneumoniae.
4. Pseudomonas aeruginosa.
5. Salmonella enteritidis.

Respuesta correcta: 4. Pseudomonas aeruginosa.